How can the fetal Rhesus be determined with non-invasive testing?

The detection of fetal RhD status can be achieved with the non-invasive method of assessing free fetal DNA in the maternal blood.